¿Cuál de las siguientes alternativas es CORRECTA en relación al tratamiento del sonambulismo?
1. Se recomienda la intervención temprana ya que es un trastorno que suele cronificarse.
2. No requiere ninguna intervención ya que la seguridad del niño nunca corre peligro.
3. Se ha empleado con éxito la técnica de los despertares programados.
4. Se suele pedir al niño que dibuje los sueños que tiene durante los episodios para disminuir la angustia.
5. No se debe intentar tranquilizar al niño y llevarle de vuelta a la cama por el peligro que supone que se despierten en ese estado.

Respuesta correcta: 3. Se ha empleado con éxito la técnica de los despertares programados.